Clinical trial exclusion criterion:
10. History of any medical or psychiatric condition or laboratory abnormality that, in the opinion of the investigator, may increase the risks associated with the study participation or administration of the investigational products, or that may interfere with the interpretation of the results.

Entity relations:
- multi("laboratory abnormality", "laboratory")
- OR("psychiatric condition", "laboratory abnormality")